¿Qué fármacos son de utilidad para frenar el hipercortisolismo endógeno?
1. Ketokonazol.
2. Metimazol.
3. Octreótido.
4. Fludrocortisona.
5. Propiltiouracilo.

Respuesta correcta: 1. Ketokonazol.